What is Hikikomori syndrome?

Hikikomori syndrome is a Japanese culture-bound syndrome and a serious social withdrawal in Japan. It is a condition in which a subject locks himself/self into a house for a prolonged period of time for the period of 6 months or more, with no evident psychosis.